下列關於失神性癲癇（absence seizures）的敘述，何者錯誤？
A. 診斷的依據是腦電圖出現不對稱、不定頻率的棘慢複合波（spike-and-wave complexes）
B. 腦雙側對稱3Hz的棘慢複合波容易以過度換氣誘發
C. 絕大部分的失神性癲癇在青少年期開始發作
D. 失神性癲癇發作時常有眨眼、咀嚼或上肢肌張力微增的現象

正確答案：A. 診斷的依據是腦電圖出現不對稱、不定頻率的棘慢複合波（spike-and-wave complexes）